下列何者無法加速麻醉的攝取（uptake）？
A. 使用脂溶性較高的吸入性麻醉劑
B. 增加病患心輸出量
C. 增加肺泡與靜脈的吸入性麻醉劑分壓差
D. 增高病人體溫

正確答案：D. 增高病人體溫